Clinical trial inclusion criterion:
ONB within 1 year post-surgery.

Annotated entities:
- Condition: "ONB"
- Temporal: "within 1 year post-surgery"
- Procedure: "surgery"
- Reference_point: "surgery"